Clinical trial exclusion criterion:
Children who are uncooperative and difficult to manage, have major systemic diseases, or are on long-term medication will be excluded.

Annotated entities:
- Condition: "uncooperative"
- Observation: "difficult to manage"
- Subjective_judgement: "major"
- Condition: "systemic diseases"
- Qualifier: "major"
- Temporal: "long-term"
- Drug: "medication"